Clinical trial inclusion criterion:
Not intending or wishing to become pregnant over the course of the study

Annotated entities:
- Pregnancy_considerations: "Not intending or wishing to become pregnant over the course of the study"